Clinical trial exclusion criterion:
Patients with known bleeding/clotting disorders

Annotated entities:
- Condition: "clotting disorders"
- Condition: "disorders bleeding"